Abnormal APTT;

The above is a clinical trial exclusion criterion. Annotated with entity spans:
[Value: Abnormal] [Measurement: APTT];